一位 71 歲男性呈現進展性呼吸困難，影像學檢查顯示有一左心房疑似血栓或腫瘤狀病變。病理切片顯示此病變內含豐富酸性黏多醣類基質，其中參雜許多星狀細胞。下列何者是此病變最可能的診斷？
A. cardiac myxoma
B. metastatic carcinoma
C. cardiac angiosarcoma
D. mural thrombus

正確答案：A. cardiac myxoma